Current or planned pregnancy

The above is a clinical trial exclusion criterion. Annotated with entity spans:
[Temporal: Current] or [Mood: planned] [Condition: pregnancy]